1. The subject is a pregnant or lactating female.

The above is a clinical trial exclusion criterion. Annotated with entity spans:
1. The subject is a [Condition: pregnant] or [Condition: lactating] [Person: female].